Clinical trial inclusion criterion:
Patient harboring a GRE or CRE bacteria

Entity relations:
- OR("GRE bacteria", "CRE bacteria")